Clinical trial exclusion criterion:
Subjects with a history of small bowel or colonic resection.

Entity relations:
- OR("small bowel resection", "colonic resection")